Patients with uncontrolled cancer;

The above is a clinical trial exclusion criterion. Annotated with entity spans:
Patients with [Qualifier: uncontrolled] [Condition: cancer];